Clinical trial exclusion criterion:
women who are pregnant, lactating, or planning on becoming pregnant

Entity relations:
- Has_mood("pregnant", "planning on becoming")
- OR("pregnant", "lactating", "pregnant")